Clinical trial exclusion criterion:
2. Myocardial infarction or unstable angina within 6 months prior to Day 1 of the study.

Annotated entities:
- Parsing_Error: "2."
- Condition: "Myocardial infarction"
- Condition: "unstable angina"
- Temporal: "within 6 months prior to Day 1 of the study"
- Reference_point: "Day 1 of the study"